Patients with a body mass index (BMI) > 40

The above is a clinical trial exclusion criterion. Annotated with entity spans:
Patients with a [Measurement: body mass index] ([Measurement: BMI]) [Value: > 40]